Clinical trial exclusion criterion:
Uncontrolled ascites or hepatic encephalopathy

Entity relations:
- Has_qualifier("ascites", "Uncontrolled")
- OR("ascites", "hepatic encephalopathy")